No history of death, serious myocardial infarction, stroke, repeat revascularization, or major bleeding

The above is a clinical trial inclusion criterion. Annotated with entity spans:
[Negation: No] [Temporal: history] of [Condition: death], [Qualifier: serious] [Condition: myocardial infarction], [Condition: stroke], [Multiplier: repeat] [Procedure: revascularization], or [Qualifier: major] [Condition: bleeding]